Clinical trial exclusion criterion:
Patients with a history of gynecologic malignancy

Annotated entities:
- Condition: "gynecologic malignancy"
- Temporal: "history"